Clinical trial exclusion criterion:
Patients who have received the PPSV23 vaccine in the last 5 years

Annotated entities:
- Drug: "PPSV23 vaccine"
- Temporal: "in the last 5 years"